Subject is scheduled for a procedure that requires general or neuraxial anesthesia

The above is a clinical trial inclusion criterion. Annotated with entity spans:
Subject is [Mood: scheduled for a procedure] that requires [Procedure: general] or [Procedure: neuraxial anesthesia]